Clinical trial exclusion criterion:
Renal disorder or insufficiency

Annotated entities:
- Condition: "Renal disorder"
- Condition: "Renal insufficiency"